Rickettsia felis was described as a human pathogen almost two decades ago, what is it's main arthropod vector?

Cat fleas (Ctenocephalides felis) carry Rickettsia felis